Clinical trial exclusion criterion:
Neuropathy, grade 2 or greater by NCI-CTCAE, v 4.0

Entity relations:
- AND("Neuropathy", "NCI-CTCAE, v 4.0")
- Has_value("NCI-CTCAE, v 4.0", "grade 2 or greater")